Clinical trial inclusion criterion:
Stable dose of NSAIDs including Cyclooxygenase-1 (COX-1) or Cyclooxygenase-2 (COX-2) inhibitors for at least 2 weeks before their Baseline Visit

Entity relations:
- Has_index("for at least 2 weeks before their Baseline Visit", "their Baseline Visit")
- Has_temporal("NSAIDs", "for at least 2 weeks before their Baseline Visit")
- OR("NSAIDs", "Cyclooxygenase-2 (COX-2) inhibitors", "inhibitors Cyclooxygenase-1 (COX-1)")